Señala cuál de las siguientes es una característica de las fobias infantiles:
1. No pueden ser eliminadas fácilmente.
2. Son específicas de una edad determinada.
3. Son de corta duración.
4. No interfieren en la vida cotidiana del niño.
5. Están relacionadas con estímulos objetivamente peligrosos.

Respuesta correcta: 1. No pueden ser eliminadas fácilmente.